Clinical trial inclusion criterion:
Diagnosis of moderate erectile dysfunction (defined according to the NIH Consensus Development Panel on Impotence) for more than 6 months and demonstrating and incomplete response to tadalafil alone

Annotated entities:
- Condition: "erectile dysfunction"
- Qualifier: "moderate"
- Temporal: "for more than 6 months"
- Drug: "tadalafil"
- Condition: "response"
- Qualifier: "incomplete"